一位 15 歲的女孩由母親帶來看門診，因為最近半年來常常有陣發性的嗜睡，在不該睡著的時候（比如上課、吃飯、與人聊天等）睡著了，約幾分鐘至 1 小時就會醒來，而且情緒激動（如生氣或大笑時）會突然全身無力，癱軟下去，但幾秒鐘後就恢復。沒發作的時候神經檢查正常。最有可能的疾病是：
A. 猝睡症（narcolepsy）
B. 腦瘤（brain tumor）
C. 甲狀腺功能過低（hypothyroidism）
D. 憂鬱症（depression）

正確答案：A. 猝睡症（narcolepsy）